Clinical trial exclusion criterion:
Patients who have experienced in-hospital CA;

Entity relations:
- Has_qualifier("CA", "in-hospital")